Female of child-bearing potential who do not use adequate contraception and women who are pregnant or breast-feeding

The above is a clinical trial exclusion criterion. Annotated with entity spans:
[Pregnancy_considerations: Female of child-bearing potential who do not use adequate contraception and women who are pregnant or breast-feeding]